Normal S-creatinine before surgery

The above is a clinical trial inclusion criterion. Annotated with entity spans:
[Value: Normal] [Measurement: S-creatinine] [Temporal: before surgery]